Clinical trial inclusion criterion:
Admissible medical/surgical history

Annotated entities:
- Temporal: "surgical history"
- Temporal: "medical history"
- Qualifier: "Admissible"